Patients who were pregnant, nursing or not able to give written informed consent were excluded.

The above is a clinical trial exclusion criterion. Annotated with entity spans:
Patients who were [Condition: pregnant], [Condition: nursing] or [Negation: not] [Observation: able to give written informed consent] were excluded.